Have a T score between -1 and -2.49 at the femoral neck, total hip, or L1-L4 spine

The above is a clinical trial inclusion criterion. Annotated with entity spans:
Have a [Measurement: T score] [Temporal: between -1 and -2.49] at the [Qualifier: femoral neck], [Qualifier: total hip], or [Qualifier: L1-L4 spine]